Which domain of the MOZ/MYST3 protein complex associates with histone H3?

MOZ/MYST3 complex associates with histone H3 with high affinity and specificity. Both proteins share a PHD finger domain.